Clinical trial inclusion criterion:
Intradermal reaction to Tuberculin (PPD skin test) or Mycobacterium tuberculosis antigenspecific interferon-gamma release assay (IGRA)

Annotated entities:
- Procedure: "Intradermal reaction to Tuberculin (PPD skin test)"
- Procedure: "Mycobacterium tuberculosis antigenspecific interferon-gamma release assay (IGRA)"